Clinical trial exclusion criterion:
Participation in another clinical study

Annotated entities:
- Competing_trial: "Participation in another clinical study"